Positive HBs Ag

The above is a clinical trial inclusion criterion. Annotated with entity spans:
[Value: Positive] [Measurement: HBs Ag]